Clinical trial exclusion criteria:
Undergoing Interleukin-2 (IL-2) therapy within 8 weeks of study entry
Diagnosed with a medical or psychiatric illness that may interfere with study participation
Pregnant

Annotated entities:
- Procedure: "Interleukin-2 (IL-2) therapy"
- Temporal: "within 8 weeks of study entry"
- Condition: "illness that may interfere with study participation medical"
- Condition: "psychiatric illness that may interfere with study participation"
- Condition: "Pregnant"